Clinical trial inclusion criterion:
Age >18

Annotated entities:
- Person: "Age"
- Value: ">18"